Clinical trial exclusion criterion:
inability to communicate pain scores or need for analgesia

Annotated entities:
- Post-eligibility: "inability to communicate pain scores or need for analgesia"